譫妄（delirium）與失智症（dementia）最好的區分為何？
A. 記憶障礙
B. 判斷力障礙
C. 意識障礙
D. 思考障礙

正確答案：C. 意識障礙